Clinical trial exclusion criterion:
A history of penetrating ocular trauma in the study eye.

Annotated entities:
- Temporal: "history of"
- Condition: "penetrating ocular trauma"
- Qualifier: "in the study eye"